Prior diagnosis of a class IV cardiovascular disease (according to the New York Heart Association, 1964), hypothyroidism, diabetes mellitus, chronic kidney disease (С3-5), or disease of liver with portal hypertension and/or severe decompensation (Child-Pugh score > 6).

The above is a clinical trial exclusion criterion. Annotated with entity spans:
Prior diagnosis of a [Value: class IV] [Condition: cardiovascular disease] (according to the [Measurement: New York Heart Association], 1964), [Condition: hypothyroidism], [Condition: diabetes mellitus], [Condition: chronic kidney disease] ([Measurement: С][Value: 3-5]), or [Condition: disease of liver] with [Condition: portal hypertension] and/or [Condition: severe decompensation] ([Measurement: Child-Pugh score] [Value: > 6]).